60歲女性病人，主訴突發左眼劇烈疼痛，視力模糊併有光暈，噁心嘔吐，瞳孔散大，血壓140/80 mmHg，照會眼科後，建議處置，下列何者最為適當：
A. 治療高血壓
B. 靜注或口服 acetazolamide
C. 使用局部止痛劑及眼球肌肉鬆弛劑
D. 使用局部類固醇

正確答案：B. 靜注或口服 acetazolamide